Clinical trial inclusion criterion:
HbA1c 8.0 - 10.5 %

Annotated entities:
- Measurement: "HbA1c"
- Value: "8.0 - 10.5 %"